65 歲肥胖的張先生最近常有左胸痛之現象。於某星期天早晨，張先生醒來後，忽然有激烈左胸痛，且疼痛有轉移至左臂之現象，並有呼吸急促，喘不過氣之情形。張先生最需要檢測的血液檢查為何？
A. 乳酸脫氫酶（lactate dehydrogenase）
B. 肌酸磷激酶- MM（creatine kinase-MM）
C. 肌肉結構蛋白- I（troponin-I）
D. 肌紅素（myoglobin）

正確答案：C. 肌肉結構蛋白- I（troponin-I）